根據 AHA/ACC guidelines for coronary artery bypass grafting（CABG），下列何者並非冠狀動脈繞道手術之 class I 適應症？
A. 只有單一左前降支近端 80%狹窄
B. 右冠狀動脈中段堵塞合併急性心肌梗塞
C. 急性心肌梗塞合併梗塞後心室中隔破裂
D. 三條冠狀動脈堵塞合併心室收縮功能不良

正確答案：B. 右冠狀動脈中段堵塞合併急性心肌梗塞